Immunocompetence*

The above is a clinical trial inclusion criterion. Annotated with entity spans:
[Condition: Immunocompetence]*